有關大腸癌各項篩檢方式的敘述，下列何者正確？
A. 大便潛血反應的特異性約可達80-90%
B. 少於10%的大腸直腸癌可藉由肛門指診摸到
C. 乙狀結腸鏡檢查（sigmoidoscope）可發現超過90%的大腸直腸癌
D. 大腸鏡檢查（colonoscope）對發現小息肉的敏感度可達95%以上

正確答案：B. 少於10%的大腸直腸癌可藉由肛門指診摸到